What is the link between TADs and GRBs?

Topologically associating domains are ancient features that coincide with Metazoan clusters of extreme noncoding conservation